Clinical trial exclusion criterion:
Subjects who are unable to undergo the MRI

Annotated entities:
- Mood: "unable to"
- Procedure: "MRI"